Planning to become pregnant in the next 2 years.

The above is a clinical trial exclusion criterion. Annotated with entity spans:
[Pregnancy_considerations: Planning to become pregnant in the next 2 years.]